Clinical trial inclusion criterion:
Stable health

Annotated entities:
- Condition: "Stable health"